Clinical trial inclusion criterion:
= 20years of age;

Entity relations:
- Has_value("age", "= 20years")